Patients with any contraindications or hypersensitivity related to antiplatelet therapy

The above is a clinical trial exclusion criterion. Annotated with entity spans:
Patients with any [Condition: contraindications] or [Condition: hypersensitivity] related to [Procedure: antiplatelet therapy]